Which enzymes synthesize catecholamines in adrenal glands?

The enzymes that synthesize catecholamines in adrenal glands are:
1) Tyrosine Hydroxylase (TH)
2) Aromatic L-amino acid decarboxylase (AAAD)
3) Dopamine β-hydroxylase (DBH)
4) Phenylethanolamine N-methyltransferase (PNMT)